Clinical trial inclusion criterion:
Has an ASDAS >= 2.1 at Screening

Entity relations:
- Has_value("ASDAS", ">= 2.1")
- Has_temporal("ASDAS", "at Screening")